General good health as established by medical history and physical examination

The above is a clinical trial inclusion criterion. Annotated with entity spans:
[Condition: General good health] as [Qualifier: established by medical history] and [Procedure: physical examination]